Clinical trial exclusion criterion:
1. Absence of objectionable cognitive impairment or presence of dementia of severe degree defined by CDR score > 2.0.

Annotated entities:
- Parsing_Error: "1."
- Subjective_judgement: "objectionable"
- Condition: "cognitive impairment"
- Qualifier: "objectionable"
- Negation: "Absence"
- Condition: "dementia"
- Qualifier: "severe degree"
- Measurement: "CDR score"
- Value: "> 2.0"